Clinical trial inclusion criterion:
Scheduled for invasive coronary angiography

Entity relations:
- Has_mood("invasive coronary angiography", "Scheduled")